Clinical trial inclusion criterion:
Scheduled for elective video-assisted thoracic surgery

Entity relations:
- Has_qualifier("video-assisted thoracic surgery", "elective")
- Has_mood("video-assisted thoracic surgery", "Scheduled for")